Clinical trial exclusion criterion:
Meningeal signs are present

Annotated entities:
- Condition: "Meningeal signs"